Existen tres pasos irreversibles en la glucólisis y son los catalizados por:
1. Hexoquinasa, fosfoglicerato quinasa y piruvato quinasa.
2. Hexoquinasa, fosfofructoquinasa y piruvato quinasa.
3. Fosfofructoquinasa, aldolasa y fosfogliceromutasa.
4. Gliceraldehído 3-fosfato deshidrogenasa, enolasa y hexoquinasa.

Respuesta correcta: 2. Hexoquinasa, fosfofructoquinasa y piruvato quinasa.